反覆性流產（recurrent pregnancy loss）的定義為大於等於幾次以上連續的自發性流產？
A. 2 次
B. 3 次
C. 4 次
D. 5 次

正確答案：B. 3 次